下列何者不是動眼神經損傷之典型臨床症狀？
A. 眼瞼下垂
B. 損傷側眼睛無法向內看
C. 瞳孔縮小
D. 複視

正確答案：C. 瞳孔縮小